Clinical trial exclusion criterion:
parental refusal

Annotated entities:
- Informed_consent: "parental refusal"